Clinical trial exclusion criterion:
Patient suffers with other cardiac rhythm disorders.

Entity relations:
- Has_qualifier("cardiac rhythm disorders", "other")